A self-reported history of loss of consciousness (greater than 10 minutes)

The above is a clinical trial exclusion criterion. Annotated with entity spans:
A [Qualifier: self-reported] [Temporal: history of loss of consciousness] ([Value: greater than 10 minutes])